感染性心內膜炎之診斷標準中，下列那一項符合 Duke criteria 之 major criteria？
A. 血液培養二套皆為 E. coli
B. 血液培養二套皆為 Acinetobacter spp.
C. 血液培養二套皆為 Klebsiella pneumoniae
D. 血液培養二套皆為 Streptococcus bovis

正確答案：D. 血液培養二套皆為 Streptococcus bovis